Clinical trial exclusion criterion:
any other factors which would interfere with pain assessment and management

Entity relations:
- AND("other factors", "interfere")
- AND("interfere", "pain assessment")
- OR("pain assessment", "management")